Cases with history of gastric ulcer diagnosed by upper endoscopy.

The above is a clinical trial exclusion criterion. Annotated with entity spans:
Cases with [Temporal: history] of [Condition: gastric ulcer] diagnosed by [Procedure: upper endoscopy].